下列有關精神分裂症之敘述，何者正確？
A. Bleuler 與 Kraepelin 意見一致，認為精神分裂症患者之功能一定會持續惡化
B. Kraepelin 為第一個取名精神分裂症（schizophrenia）之學者
C. Bleuler 4 As 內含聯想障礙（associational disturbances of thought）
D. Kraepelin 所謂的三種嚴重精神疾病不包括妄想症（paranoia）

正確答案：C. Bleuler 4 As 內含聯想障礙（associational disturbances of thought）